Clinical trial inclusion criterion:
Stable concomitant Disease Modifying Anti-Rheumatic Drugs (DMARDs)

Annotated entities:
- Multiplier: "Stable"
- Temporal: "concomitant"
- Drug: "Disease Modifying Anti-Rheumatic Drugs (DMARDs)"